社會保險與商業保險的特性有些是相同的，也有些是不同的，下列何者是它們相同之處？
A. 目的
B. 所追求的公平
C. 費率計算方式
D. 重視效率

正確答案：D. 重視效率